¿Cuál es tratamiento de elección ante una infestación por pediculus humanus capitis o piojo de la cabeza?:
1. Crema o loción de permetrina al 1% y nueva aplicación en 7-10 días.
2. Crema o loción de líndano al 1% y nueva aplicación en 5 días.
3. Loción de ácido acético al 2% diario durante 7 días.
4. Crema de mebendazol 100 mg en una sola aplicación.

Respuesta correcta: 1. Crema o loción de permetrina al 1% y nueva aplicación en 7-10 días.